Clinical trial exclusion criterion:
Unexplained bleeding from the genital tract

Annotated entities:
- Condition: "Unexplained bleeding"
- Qualifier: "genital tract"